Which is the relation between coffee consumption and stroke risk?

The coffee paradox in stroke: Increased consumption linked with fewer strokes.